Established ischemic heart disease, peripheral arterial disease and/or cerebrovascular disease.

The above is a clinical trial exclusion criterion. Annotated with entity spans:
Established [Condition: ischemic heart disease], [Condition: peripheral arterial disease] and/or [Condition: cerebrovascular disease].